2. advanced labor

The above is a clinical trial exclusion criterion. Annotated with entity spans:
2. [Condition: advanced labor]